Clinical trial exclusion criterion:
Has received any licensed or other investigational influenza vaccine within 3 months prior to enrollment in this study or expected receipt of any influenza vaccination before the Day 21 blood collection

Annotated entities:
- Drug: "influenza vaccine"
- Qualifier: "licensed"
- Qualifier: "other investigational"
- Temporal: "within 3 months prior to enrollment in this study"
- Reference_point: "enrollment in this study"
- Observation: "expected receipt"
- Non-query-able: "expected receipt"
- Drug: "any influenza vaccination"
- Temporal: "before the Day 21"
- Reference_point: "Day 21"